Clinical trial exclusion criterion:
Contraindications to disulfiram treatment (liver disease, kidney disease, cardiac disease, seizure disorder, hypothyroidism, diabetes mellitus, pregnancy or lactation, allergy to disulfiram or thiuran derivatives)

Annotated entities:
- Condition: "Contraindications"
- Drug: "disulfiram"
- Condition: "liver disease"
- Condition: "kidney disease"
- Condition: "cardiac disease"
- Condition: "seizure disorder"
- Condition: "hypothyroidism"
- Condition: "diabetes mellitus"
- Condition: "pregnancy"
- Condition: "lactation"
- Condition: "allergy"
- Drug: "disulfiram"
- Drug: "thiuran derivatives"